Para proceder a la elaboración de supositorios por el método de vertido es preciso calcular el factor de desplazamiento que indica:
1. El peso, en gramos, de fármaco que es desplazado por un gramo de excipiente.
2. El volumen de excipiente que es desplazado por 100 mL de fármaco.
3. El peso, en gramos, de excipiente que es desplazado por 1mL de fármaco.
4. El peso, en gramos, de fármaco que es desplazado por 1mL de excipiente.
5. El peso, en gramos, de excipiente desplazado por un gramo de fármaco.

Respuesta correcta: 5. El peso, en gramos, de excipiente desplazado por un gramo de fármaco.